community-acquired pneumonia: the presence of radiologically confirmed infiltration of the lung tissue; the presence of at least two of the following clinical signs: acute fever early in the disease (temperature > 38.0°C), cough with sputum, the physical signs of pneumonia (focus of crepitate and/or fine bubble rales, bronchial breathing hard, shortening of percussion sounds), leukocytosis > 10*10 9 /l and/or stab shift > 10%; the occurrence of the disease outside the hospital and the organized groups (such as nursing homes, sanatoriums, etc.).

The above is a clinical trial inclusion criterion. Annotated with entity spans:
[Condition: community-acquired pneumonia]: the presence of [Qualifier: radiologically confirmed] [Condition: infiltration of the lung tissue]; the presence of [Multiplier: at least two] of the following clinical signs: [Condition: acute fever] [Temporal: early in the disease] ([Measurement: temperature] [Value: > 38.0°C]), [Condition: cough with sputum], the [Condition: physical signs] of [Condition: pneumonia] (focus of [Condition: crepitate] and/or [Condition: fine bubble rales], [Condition: bronchial breathing hard], [Condition: shortening of percussion sounds]), [Measurement: leukocytosis] [Value: > 10*10 9 /l] and/or [Measurement: stab shift] [Value: > 10%]; the occurrence of the disease outside the hospital and the organized groups (such as nursing homes, sanatoriums, etc.).